Clinical trial inclusion criterion:
Previous liver transplantation(more than 6 month).

Annotated entities:
- Procedure: "liver transplantation"
- Temporal: "Previous"
- Temporal: "more than 6 month"